Clinical trial exclusion criterion:
Previous myocardial revascularization surgery with = 1 internal mammary or radial artery graft;

Annotated entities:
- Procedure: "myocardial revascularization surgery"
- Temporal: "Previous"
- Device: "internal mammary graft"
- Device: "radial artery graft"
- Multiplier: "= 1"